Las células caliciformes pertenecen al tejido:
1. Epitelial.
2. Conjuntivo.
3. Cartilaginoso.
4. Óseo.
5. Adiposo.

Respuesta correcta: 1. Epitelial.